Clinical trial exclusion criterion:
Previous known hypersensitivity to tetracyclines

Annotated entities:
- Condition: "hypersensitivity"
- Drug: "tetracyclines"
- Temporal: "Previous"